Clinical trial exclusion criterion:
Has a known history of human immunodeficiency virus (HIV)

Entity relations:
- Has_temporal("human immunodeficiency virus (HIV)", "history")